Clinical trial inclusion criteria:
proven acute deep venous thrombosis, less than 21 days and who were referred to the interventional radiology department.

Annotated entities:
- Qualifier: "acute"
- Condition: "deep venous thrombosis"
- Qualifier: "proven"
- Multiplier: "less than 21 days"
- Visit: "interventional radiology department"
- Mood: "referred to"